Which conditions is caused by mutations in HFE?

Mutations in HFE, a gene encoding a putative lysosomal trafficking protein, cause hereditary hemochromatosis.